Clinical trial exclusion criterion:
Pregnancy and lactation

Annotated entities:
- Condition: "Pregnancy"
- Condition: "lactation"
- Grammar_Error: "and"